Clinical trial inclusion criterion:
Patients of ASA status I - III

Annotated entities:
- Measurement: "ASA status"
- Value: "I - III"